Clinical trial inclusion criterion:
Taking an NNRTI or integrase containing regimen with prior exposure to PI greater than 2 weeks. It must be clearly stated in the source document that PI was switched to another agent for convenience.

Annotated entities:
- Drug: "NNRTI"
- Drug: "integrase"
- Procedure: "regimen"
- Drug: "PI"
- Temporal: "prior"
- Temporal: "greater than 2 weeks"